Clinical trial inclusion criteria:
uterine size <12 weeks.
presence of benign cause for the hysterectomy e.g. fibroid uterus, perimenopausal beeding not responding to medical treatment or complex endometrial hyperplasia without atypia.
Absence of significant scarring in the pelvis from previous surgeries.

Annotated entities:
- Measurement: "uterine size"
- Value: "<12 weeks"
- Condition: "benign cause"
- Procedure: "hysterectomy"
- Condition: "fibroid uterus"
- Condition: "perimenopausal beeding"
- Negation: "not"
- Qualifier: "responding to medical treatment"
- Procedure: "medical treatment"
- Condition: "complex endometrial hyperplasia"
- Negation: "without"
- Condition: "atypia"
- Negation: "Absence"
- Condition: "significant scarring"
- Qualifier: "pelvis"
- Qualifier: "from previous surgeries"
- Temporal: "previous"
- Procedure: "surgeries"